Miller class 1, 2 and 3 recession defects will be included

The above is a clinical trial inclusion criterion. Annotated with entity spans:
[Measurement: Miller] [Value: class 1, 2 and 3] [Condition: recession defects] will be included